Paciente de 44 años de edad que sufre un traumatismo por accidente de tráfico de elevada intensidad. A su ingreso en el hospital está consciente y orientado y manifiesta dolor a nivel torácico cervical y pélvico así como impotencia funcional en miembro inferior derecho. La exploración física pone de manifiesto una presión arterial de 100/60 mmHg con 100 pulsaciones/minuto, una abolición del murmullo vesicular en el tercio inferior del hemitórax derecho y matidez a la percusión del mismo. En la radiografía de tórax se aprecia un derrame pleural derecho, también en el tercio inferior. ¿Cuál de estas afirmaciones le parece correcta?
1. Se trata de una gran hemorragia pulmonar por lo que el paciente debe ser intervenido de urgencia mediante toracotomía.
2. Al tratarse de una hemorragia intratorácica, es de esperar una hemostasia espontánea por lo que no está indicada ninguna medida terapéutica.
3. Está indicado un drenaje de la cavidad pleural con un catéter de grueso calibre y la monitorización del paciente.
4. La simple punción-evacuadora con aguja es el tratamiento de elección.
5. Se trata más probablemente de un quilotórax por lo que debe establecerse un tratamiento con restricción de triglicéridos de cadena pesada.

Respuesta correcta: 3. Está indicado un drenaje de la cavidad pleural con un catéter de grueso calibre y la monitorización del paciente.